What is the name of the RNAi investigational drug being developed against hereditary amyloidosis?

The investigational RNAi drug in development for the treatment of hereditary amyloidosis is patisiran.